下列有關 Mycoplasma pneumoniae 引起之肺炎的敘述，何者錯誤？
A. 好發於 5 歲至 20 歲的年齡層
B. 潛伏期為 3～5 天
C. 除了肺部症狀以外，有時會有多型性紅斑（erythema multiforme）、心肌炎或是腦神經系統的症狀
D. cold agglutinin test 可以當做實驗室診斷的輔助項目

正確答案：B. 潛伏期為 3～5 天